Clinical trial exclusion criterion:
Positive drug addictions* (verbal interrogatory)

Entity relations:
- AND("Positive drug addictions", "verbal interrogatory")